NOSE score greater than 55

The above is a clinical trial inclusion criterion. Annotated with entity spans:
[Measurement: NOSE score] [Value: greater than 55]